La secreción de insulina por las células pancreáticas está regulada positivamente por:
1. Inhibición de la hexoquinasa IV.
2. Activación de canales de K+.
3. Inactivación de canales de Ca++.
4. Alta concentración de ATP.
5. Bajos niveles de glucosa en sangre.

Respuesta correcta: 4. Alta concentración de ATP.